Which genes belong to the AUX/IAA family of transcription repressors in plants?

Auxin is sensed by SCFTIR1-IAA6 and SCFTIR1-IAA19 co-receptor complexes, which leads to IAA6/IAA19 ubiquitylation in vitro and IAA6/IAA19 degradation in vivo. EgrIAA4 protein is localized in the nucleus and functions as an auxin-responsive repressor. Evidence also exists for SCF(TIR1)-mediated ubiquitination of the Aux/IAA proteins SHY2/IAA3 and BDL/IAA12